¿Qué condiciones debe cumplir una muestra de participantes de un estudio para que sea representativa de la población?:
1. Que se haya obtenido por aplicación de un muestreo de juicio o selección experta.
2. Que su tamaño sea suficiente y se haya conseguido que las variables que caracterizan a la población estén presentes en la muestra.
3. Que los criterios de inclusión y exclusión en la muestra sean conocidos y públicos.
4. Que la población objetivo sea lo más cercana posible a la población.

Respuesta correcta: 2. Que su tamaño sea suficiente y se haya conseguido que las variables que caracterizan a la población estén presentes en la muestra.